Clinical trial inclusion criterion:
18 years of age or older;

Entity relations:
- Has_value("age", "18 years or older")